Clinical trial inclusion criterion:
The patient was confirmed to have a history of gastric ulcer or duodenal ulcer.

Annotated entities:
- Condition: "gastric ulcer"
- Condition: "duodenal ulcer"
- Temporal: "history"